胸管（thoracic duct）和下列那一構造一起穿過橫膈膜進入胸腔？
A. 下腔靜脈
B. 食道
C. 主動脈
D. 迷走神經

正確答案：C. 主動脈